Planned to start docetaxel component of FEC-D or AC-D, or first cycle of; dose-dense AC-T, TC, FEC-D or TAC chemotherapy

The above is a clinical trial inclusion criterion. Annotated with entity spans:
[Mood: Planned to start] [Drug: docetaxel] component of [Procedure: FEC-D] or [Procedure: AC-D], or [Multiplier: first cycle of]; [Procedure: dose-dense AC-T], [Procedure: TC], [Procedure: FEC-D] or [Procedure: TAC chemotherapy]